Clinical trial inclusion criterion:
fingolimod,

Annotated entities:
- Drug: "fingolimod"